原發性蜘蛛網膜下腔出血（spontaneous subarachnoid hemorrhage）最常見的病因為下列何者？
A. 高血壓（hypertension）
B. 動靜脈畸型（arteriovenous malformation）
C. 動脈瘤（aneurysm）
D. 腦瘤（brain tumor）

正確答案：C. 動脈瘤（aneurysm）